Liver dysfunction and elevated Liver Function Tests (LFTs)

The above is a clinical trial exclusion criterion. Annotated with entity spans:
[Condition: Liver dysfunction] and [Value: elevated] [Measurement: Liver Function Tests] ([Measurement: LFTs])